Clinical trial exclusion criteria:
Died before TAVI
Not willing to participate

Annotated entities:
- Observation: "Died"
- Temporal: "before TAVI"
- Informed_consent: "Not willing to participate"